¿Cuál es la edad de mayor riesgo para el inicio de la fobia social?:
1. Infancia.
2. Adolescencia.
3. Madurez.
4. Senectud.

Respuesta correcta: 2. Adolescencia.